Clinical trial exclusion criterion:
Any condition/illness that may affect the study outcomes or would make participation potentially harmful such as pregnancy or breastfeeding, diabetes mellitus, heart disease, stroke, hypertension, malabsorption syndromes, GERD, a history of ulcer, according to a detailed medical history.

Annotated entities:
- Condition: "pregnancy"
- Observation: "breastfeeding"
- Condition: "diabetes mellitus"
- Condition: "heart disease"
- Condition: "stroke"
- Condition: "hypertension"
- Condition: "malabsorption syndromes"
- Condition: "GERD"
- Temporal: "history of"
- Condition: "ulcer"
- Condition: "illness that may affect the study outcomes"
- Condition: "illness that would make participation potentially harmful"
- Temporal: "medical history"